Clinical trial exclusion criterion:
Complications to RYGB. Documented reactive hypoglycaemia, severe dumping (vomiting, diarrhea, severe abdominal pain after food intake)

Entity relations:
- AND("Complications", "RYGB")
- Has_index("after food intake", "food intake")
- Has_temporal("abdominal pain", "after food intake")
- Has_qualifier("abdominal pain", "severe")
- Has_qualifier("dumping", "severe")
- Subsumes("dumping", "vomiting")
- Subsumes("Complications", "reactive hypoglycaemia")
- OR("vomiting", "abdominal pain", "diarrhea")
- OR("reactive hypoglycaemia", "dumping")